What is the aim of the Human Chromosome-centric Proteome Project (C-HPP)?

The chromosome-centric human proteome project aims to systematically map all human proteins, chromosome by chromosome, in a gene-centric manner through dedicated efforts from national and international teams